Clinical trial inclusion criterion:
Treating clinician deems infant eligible to receive 2-month vaccines

Annotated entities:
- Mood: "eligible"
- Drug: "2-month vaccines"